Clinical trial inclusion criterion:
(4)Voluntarily participates and has signed an informed consent form.

Annotated entities:
- Observation: "signed an informed consent"
- Observation: "Voluntarily participates"